下列何者關於知覺（perception）評估的敘述錯誤？
A. 知覺異常的臨床表現可能為幻覺（hallucination）或錯覺（illusion）
B. 知覺異常經常與感覺系統有關，例如視覺、聽覺、嗅覺、觸覺等
C. 幻覺發生的情境在知覺評估當中並不重要
D. 使用古柯鹼（cocaine）可能造成有蟲或螞蟻在皮膚下爬行的幻覺（formication）

正確答案：C. 幻覺發生的情境在知覺評估當中並不重要